Clinical trial exclusion criterion:
History of knee surgery in the target knee;

Annotated entities:
- Procedure: "knee surgery"
- Reference_point: "target knee"
- Temporal: "History"